Clinical trial exclusion criterion:
Pregnancy or breastfeeding (disproved by a negative pregnancy test before trial inclusion)

Annotated entities:
- Condition: "Pregnancy"
- Observation: "breastfeeding"
- Value: "negative"
- Procedure: "pregnancy test"
- Temporal: "before trial inclusion"
- Reference_point: "trial inclusion"
- Negation: "disproved by"